Lobar pneumonia or pneumoniae with pleural effusion

The above is a clinical trial inclusion criterion. Annotated with entity spans:
[Condition: Lobar pneumonia] or [Condition: pneumoniae] with [Condition: pleural effusion]